Clinical trial inclusion criteria:
Patients presenting for elective posterior spinal fusion surgery (lower thoracic, lumbar, sacral)
Ages 18-80

Annotated entities:
- Procedure: "posterior spinal fusion surgery"
- Qualifier: "elective"
- Qualifier: "lower thoracic"
- Qualifier: "lumbar"
- Qualifier: "sacral"
- Person: "Ages"
- Value: "18-80"